Clinical trial exclusion criterion:
Long term use of aspirin or P2Y12 receptor antagonist within 1month

Annotated entities:
- Qualifier: "Long term"
- Drug: "aspirin"
- Drug: "P2Y12 receptor antagonist"
- Temporal: "within 1month"